下列有關鐵之敘述，何者正確？
A. 鐵的吸收主要在胃
B. 鐵在體內的貯存型態主要以 ferritin 和 hemosiderin 兩種為主
C. 鐵的吸收主要以 3 價鐵離子為主
D. 正常人每天約排泄 10 毫克的鐵

正確答案：B. 鐵在體內的貯存型態主要以 ferritin 和 hemosiderin 兩種為主